Which is the prognostic meaning of delayed enhancement documented in patients hypertrophic cardiomyopathy?

Delayed enhancement by CMR has prognostic value in predicting adverse cardiovascular events among HCM patients, and is associated with cardiovascular mortality, heart failure death, and all-cause mortality in HCM.